Clinical trial inclusion criterion:
have no prior CAD associated event (no prior myocardial infarction, acute coronary syndrome, coronary angiogram, or PCI),

Annotated entities:
- Negation: "no"
- Condition: "CAD"
- Condition: "myocardial infarction"
- Condition: "acute coronary syndrome"
- Procedure: "coronary angiogram"
- Procedure: "PCI"